Clinical trial exclusion criterion:
Any history of pancreatic injury, pancreatitis or evidence of impaired pancreatic function/injury as indicated by abnormal lipase or amylase Evidence of hepatic disease, a history of hepatic encephalopathy, a history of esophageal varices, or a history of portocaval shunt

Entity relations:
- Has_value("pancreatic function", "impaired")
- Has_value("lipase", "abnormal")
- Has_value("amylase", "abnormal")
- Subsumes("impaired", "lipase")
- AND("history", "pancreatic injury")
- AND("history", "hepatic encephalopathy")
- AND("history", "esophageal varices")
- AND("history", "portocaval shunt")
- OR("lipase", "amylase")
- OR("pancreatic injury", "pancreatitis", "pancreatic injury", "pancreatic function")
- OR("history", "hepatic disease", "history", "history", "history")